Clinical trial exclusion criterion:
Infection at the injection site

Annotated entities:
- Condition: "Infection"
- Qualifier: "injection site"